¿En qué núcleos se producen las hormonas oxitocina y vasopresina que son liberadas por la neurohipófisis?:
1. Los núcleos preóptico medial y dorsomedial del hipotálamo.
2. Los núcleos arqueado y suprequiasmástico del hipotálamo.
3. Los núcleos supraóptico y paraventricular del hipotálamo.
4. Los núcleos ventromedial y preóptico lateral del hipotálamo.

Respuesta correcta: 3. Los núcleos supraóptico y paraventricular del hipotálamo.